Mientras realiza la anamnesis a un paciente que consulta por dolor torácico en un Servicio de Urgencias, éste pierde la conciencia, usted le estimula y no responde, le abre la vía aérea y comprueba que el paciente no respira y no le encuentra el pulso carotídeo. Tras pedir ayuda, ¿cuál es la siguiente maniobra que debería realizar?
1. Compresiones torácicas.
2. Golpe precordial.
3. Ventilaciones de rescate.
4. Intubación oro-traqueal.

Respuesta correcta: 1. Compresiones torácicas.